重建鼻中隔（nasal septum）時需要修復①鼻骨 ②隔軟骨 ③下鼻甲骨 ④篩骨 ⑤犁骨  ⑥額骨等六個構造中的那些？
A. ①③⑥
B. ②④⑤
C. ③④⑥
D. ①②⑤

正確答案：B. ②④⑤